Patients must have measurable disease. If prior radiation therapy was administered, measurable disease must be outside the radiation field.

The above is a clinical trial inclusion criterion. Annotated with entity spans:
Patients must have [Qualifier: measurable disease]. If prior [Procedure: radiation therapy] was administered, [Qualifier: measurable disease] must be [Qualifier: outside the radiation field].